Which are the main NMD factors in Saccharomyces cerevisiae?

In Saccharomyces cerevisiae, rapid degradation of nonsense-containing mRNAs requires the three nonsense-mediated mRNA decay (NMD) factors, Upf1p, Nmd2p, and Upf3p.